Clinical trial exclusion criterion:
Patients with significant abnormalities in hepatic or renal function which would, in the opinion of the investigator, prevent the patients involvement in the study

Annotated entities:
- Condition: "abnormalities in hepatic function"
- Condition: "abnormalities in renal function"